Unable to walk (ex: wheelchair subjects)

The above is a clinical trial exclusion criterion. Annotated with entity spans:
[Condition: Unable to walk] (ex: [Observation: wheelchair subjects])